¿Cuál de los siguientes instrumentos permite obtener una medida directa de la dimensión “Apertura a la experiencia” de la personalidad?:
1. Cuestionario EPQ-R de Eysenck.
2. Inventario de Personalidad NEO-PI-R.
3. Inventario Multifásico de Personalidad de Minnesota (MMPI).
4. Inventario Clínico Multiaxial de Millon (MCM).
5. Cuestionario 16 PF de Cattell.

Respuesta correcta: 2. Inventario de Personalidad NEO-PI-R.